單側脊髓背側神經根進口區（dorsal entry root lesion）手術治療疼痛控制，臨床應用常見的合併症（complication）是：
A. 同側運動功能減弱
B. 對側運動功能減弱
C. 同側感覺功能消失
D. 對側感覺功能消失

正確答案：A. 同側運動功能減弱